Clinical trial inclusion criterion:
Patients over 18 years old

Annotated entities:
- Value: "over 18 years"
- Person: "old"